Clinical trial inclusion criterion:
Healthy patients

Annotated entities:
- Condition: "Healthy"